有關消化性潰瘍手術後的早期併發症，下列敘述何者錯誤？
A. 術後出血
B. 縫線處滲漏（sutureline leakage）
C. 胰臟損傷
D. 吻合處功能遲緩（stomal delay）

正確答案：D. 吻合處功能遲緩（stomal delay）